Clinical trial exclusion criterion:
Allergy to local anaesthesia

Entity relations:
- AND("Allergy", "local anaesthesia")